服用下列何種血管舒張劑易產生紅斑性狼瘡的副作用？
A. Hydralazine
B. Minoxidil
C. Captopril
D. Sildenafil

正確答案：A. Hydralazine